Clinical trial inclusion criterion:
SLEDAI >/= 6 at screening visit

Entity relations:
- Has_index("at screening visit", "screening visit")
- Has_value("SLEDAI", ">/= 6")
- Has_temporal("SLEDAI", "at screening visit")